What are the most frequent non-canonical sequence motifs at the donor and acceptor splice sites in vertebrates?

There are two major exceptions to the canonical GT-AG dinucleotides at donor and acceptor sites: the GG-AG splice site pairs, recognized through the typical U2 splicing machinery, and the AT-AC splice pairs recognized by the U12 splicing machinery.